Clinical trial inclusion criterion:
Healthy children aged 6 months to 72 months

Entity relations:
- Has_value("aged", "6 months to 72 months")